Clinical trial exclusion criterion:
Known acute pericarditis and/or subacute bacterial endocarditis

Annotated entities:
- Condition: "acute pericarditis"
- Condition: "subacute bacterial endocarditis"